What is the effect of TRH on myocardial contractility?

TRH improves myocardial contractility